腹腔鏡手術過程中，病人採髖關節過度外翻及屈曲姿勢，易造成過度伸展及受損之神經為：
A. 三叉神經及副神經
B. 尺神經及橈神經
C. 股神經及坐骨神經
D. 腋神經及臂神經

正確答案：C. 股神經及坐骨神經